patients with Marfan syndrome;

The above is a clinical trial exclusion criterion. Annotated with entity spans:
patients with [Condition: Marfan syndrome];